Clinical trial exclusion criterion:
In the list of heart transplantation;

Entity relations:
- Has_mood("heart transplantation", "In the list")